Clinical trial exclusion criterion:
Type 1 diabetes, gestational diabetes, or secondary forms of diabetes

Annotated entities:
- Condition: "Type 1 diabetes"
- Condition: "gestational diabetes"
- Condition: "secondary forms of diabetes"